Clinical trial exclusion criterion:
Use of probenecid like drugs

Entity relations:
- multi("probenecid like drugs", "probenecid like")
- multi("probenecid like", "probenecid")